下列關於胸腔穿刺（thoracentesis）敘述何者錯誤？
A. 需避開肋骨下緣之肋間神經、血管（intercostal nerve, vessel）
B. 穿刺時需在吐氣（expiration）時進行
C. 一般在第九肋間穿刺最適當
D. 常在鎖骨中線（midclavicular line）位置進行穿刺

正確答案：D. 常在鎖骨中線（midclavicular line）位置進行穿刺